Clinical trial inclusion criterion:
Liver Transplant Recipients have no acute rejection episodes within 3 months prior to the enrollment and are clinically stable

Entity relations:
- Has_qualifier("rejection episodes", "acute")
- Has_negation("rejection episodes", "no")
- Has_index("within 3 months prior to the enrollment", "the enrollment")
- Has_temporal("rejection episodes", "within 3 months prior to the enrollment")